Clinical trial exclusion criterion:
History of Hepatitis B infection

Annotated entities:
- Condition: "Hepatitis B infection"